La terapia de Aceptación y Compromiso se estructura en torno a dos conceptos centrales, ¿cuáles son?
1. La Evitación Experiencial y los Valores personales.
2. La Aceptación y la Validación.
3. La Activación y el Compromiso.
4. La Evitación Experiencial y la Reestructuración Cognitiva.
5. La Vulnerabilidad emocional y la defusión cognitiva.

Respuesta correcta: 1. La Evitación Experiencial y los Valores personales.